What is Bexsero?

Bexsero is amulticomponent vaccine against serogroup B Neisseria meningitidis (MenB).